Clinical trial exclusion criterion:
Certain infectious endocarditis

Annotated entities:
- Condition: "infectious endocarditis"
- Qualifier: "Certain"